Clinical trial inclusion criterion:
Culture result consistent with MDR gram negative for this febrile neutropenic episode.

Entity relations:
- Has_qualifier("gram negative", "MDR")